Smoked at least 100 cigarettes in lifetime

The above is a clinical trial inclusion criterion. Annotated with entity spans:
[Observation: Smoked] [Multiplier: at least 100 cigarettes] in lifetime